從肺炎病人痰液中分離出下列何種病菌，即可確立該菌為致病菌？
A. 綠膿桿菌（Pseudomonas aeruginosa）
B. 肺結核分枝桿菌（Mycobacterium tuberculosis）
C. 嗜血性感冒桿菌（Haemophilus influenzae）
D. 草綠色鏈球菌（Viridans streptococci）

正確答案：B. 肺結核分枝桿菌（Mycobacterium tuberculosis）